Post-procedural residual diameter stenosis of the treated lesions < 20% in patients with stent implantation or < 50% in those with balloon angioplasty

The above is a clinical trial inclusion criterion. Annotated with entity spans:
[Observation: Post-procedural residual diameter stenosis] of the [Qualifier: treated] [Condition: lesions] [Value: < 20%] in patients with [Procedure: stent implantation] or [Value: < 50%] in those with [Procedure: balloon angioplasty]